下列何種藥物的藥理作用機轉，是抑制膽鹼性神經釋放乙醯膽鹼？
A. amphetamine
B. botulinum toxin
C. cocaine
D. tubocurarine

正確答案：B. botulinum toxin